La DNA Girasa es una:
1. Topoisomerasa II eucariótica.
2. Topoisomerasa I eucariótica.
3. Topoisomerasa II procariótica.
4. Helicasa eucariótica.

Respuesta correcta: 3. Topoisomerasa II procariótica.